Los corpúsculos de Pacini:
1. Están inervados por fibras amielínicas.
2. Son mecanorreceptores de adaptación lenta.
3. Presentan campos receptores pequeños.
4. Se localizan en zonas profundas de la dermis.
5. Son termorreceptores.

Respuesta correcta: 4. Se localizan en zonas profundas de la dermis.